Clinical trial inclusion criteria:
Irritable Bowel Syndrome (IBS) (ROME III criteria): subtype with diarrhea or mixed form
age 18-65 years

Annotated entities:
- Condition: "Irritable Bowel Syndrome (IBS)"
- Qualifier: "ROME III criteria"
- Condition: "diarrhea"
- Qualifier: "mixed form"
- Person: "age"
- Value: "18-65 years"